Lower limb surgery preceding year

The above is a clinical trial exclusion criterion. Annotated with entity spans:
[Procedure: Lower limb surgery] preceding year